Clinical trial exclusion criterion:
Antihypertensives (<3 medications on a stable dose for ≥ 30 days);

Entity relations:
- Has_multiplier("stable dose", "<3 medications")
- Has_temporal("stable dose", "for ≥ 30 days")
- Has_qualifier("Antihypertensives", "stable dose")